Clinical trial exclusion criterion:
Pregnant women or likely to be in the absence of effective contraception,

Entity relations:
- Has_mood("Pregnant", "likely to be")
- Has_qualifier("Pregnant", "in the absence of effective contraception")
- OR("Pregnant", "Pregnant")